一個病人因為跌倒撞到手肘，2個月後來就診，發現在內收拇肌（adductor pollicis）及骨間肌（interossei）有萎縮現象，最有可能是那一條神經病變？
A. 正中神經
B. 橈神經
C. 尺神經
D. 肌皮神經

正確答案：C. 尺神經